Clinical trial inclusion criterion:
18 years old or older

Entity relations:
- Has_value("old", "18 years or older")